Patients with central nervous system disease are eligible for enrollment if they have received prior radiotherapy or surgery to sites of CNS metastatic disease and are without evidence of clinical progression for at least 4 weeks prior to screening, have no evidence of new or enlarging brain metastases, and are off steroids for at least 7 days before first dose of pembrolizumab.

The above is a clinical trial inclusion criterion. Annotated with entity spans:
Patients with [Condition: central nervous system disease] are eligible for enrollment if they have received prior [Procedure: radiotherapy] or [Procedure: surgery] to sites of [Condition: CNS metastatic disease] and are [Negation: without] evidence of [Condition: clinical progression] [Temporal: for at least 4 weeks prior to screening], have [Negation: no] evidence of [Qualifier: new] or [Qualifier: enlarging] [Condition: brain metastases], and are [Negation: off] [Drug: steroids] [Temporal: for at least 7 days before first dose of pembrolizumab].